下列那一類分子透過結合並活化peroxisome proliferator-activated recepter alpha（PPARα），以調控生酮作用（ketogenesis）相關基因的表現？
A. purine
B. fatty acids
C. glucose
D. pyrimidine

正確答案：B. fatty acids